Clinical trial exclusion criterion:
Active cancer

Entity relations:
- Has_temporal("cancer", "Active")